Roughly how many base pairs are in the human mitochondrial genome or mtDNA?

The number of base pairs in the human mitochondrial genome (mhl) is currently estimated at 16569.